褐菌絲症（phaeohyphomycosis）為新興之真菌感染症，此群真菌共同之特徵為何？
A. 具有兩型性（dimorphism）之酵母菌
B. 喜於 37℃生長之絲狀真菌
C. 會產生類似黑色素（melanin-like）之絲狀真菌或酵母菌
D. 同時產生大型頂端芽胞（macroconidia）及小型頂端芽胞（microconidia）之絲狀真菌

正確答案：C. 會產生類似黑色素（melanin-like）之絲狀真菌或酵母菌